Clinical trial exclusion criteria:
Age less than 18
Clinical or laboratory evidence of systemic infection
Current pregnancy as assessed by preoperative urine HCG test
Serious, uncontrolled, non-malignant illness
Malignant illness requiring systemic chemotherapy in the last 6 months
Documented allergy to oxycodone, morphine sulfate or acetaminophen
Contraindication to peripheral nerve blockade or general anesthesia including:
1. patient refusal
2. active infection at site of planned block
3. documented allergy to any local or general anesthetic medications
4. significant coagulopathy( prothrombin time >15 seconds, INR>1.5
5. pre-existing neuropathy and medical conditions or deformities which would compromise block or anesthetic safety
Planned pleurodesis
Current use of high dose inhaled or systemic steroids
Current use of Amiodarone (Cordarone)
Morbid obesity (BMI=40kg/m2)
Patients with clinically significant mental health issues such as psychosis requiring treatment with antipsychotic medications.
Patients unable to consent
Patients with active infections requiring antibiotics within one month of registration
Participation in other clinical trials that may interfere with this study

Annotated entities:
- Person: "Age"
- Value: "less than 18"
- Undefined_semantics: "Clinical or laboratory evidence of systemic infection"
- Temporal: "preoperative"
- Measurement: "urine HCG test"
- Value: "pregnancy"
- Condition: "pregnancy"
- Condition: "non-malignant illness"
- Qualifier: "uncontrolled"
- Qualifier: "Serious"
- Condition: "Malignant illness"
- Procedure: "systemic chemotherapy"
- Temporal: "in the last 6 months"
- Drug: "oxycodone"
- Drug: "morphine sulfate"
- Drug: "acetaminophen"
- Condition: "allergy"
- Condition: "Contraindication to peripheral nerve blockade"
- Condition: "Contraindication to general anesthesia"
- Non-query-able: "1. patient refusal"
- Non-query-able: "2. active infection at site of planned block"
- Undefined_semantics: "3. documented allergy to any local or general anesthetic medications"
- Condition: "coagulopathy"
- Qualifier: "significant"
- Measurement: "prothrombin time"
- Value: ">15 seconds"
- Measurement: "INR"
- Value: ">1.5"
- Condition: "neuropathy"
- Temporal: "pre-existing"
- Undefined_semantics: "medical conditions or deformities which would compromise block or anesthetic safety"
- Condition: "pleurodesis"
- Non-query-able: "Planned pleurodesis"
- Drug: "steroids"
- Qualifier: "inhaled"
- Qualifier: "systemic"
- Qualifier: "high dose"
- Temporal: "Current"
- Drug: "Amiodarone"
- Drug: "Cordarone"
- Temporal: "Current"
- Condition: "Morbid obesity"
- Measurement: "BMI"
- Value: "40kg/m2"
- Condition: "mental health issues"
- Condition: "psychosis"
- Drug: "antipsychotic medications"
- Procedure: "treatment"
- Qualifier: "clinically significant"
- Non-query-able: "Patients unable to consent"
- Condition: "infections"
- Temporal: "active"
- Drug: "antibiotics"
- Temporal: "within one month of registration"
- Non-query-able: "Participation in other clinical trials that may interfere with this study"